Clinical trial exclusion criterion:
Patients with thyroid pathology, the treatment of which has not been stabilized for at least three months.

Annotated entities:
- Condition: "thyroid pathology"
- Temporal: "at least three months"
- Negation: "not"
- Qualifier: "stabilized"
- Procedure: "treatment"